一名 30 歲男性，因手術治療腦下垂體腫瘤（Pituitary adenoma）導致前葉功能降低。關於下列激素治療的敘述，何者正確？
A. 補充雄性素（Androgen）可恢復病患之生育能力
B. 不需要補充甲狀腺素
C. 需補充抗利尿激素（ADH）以防止尿崩症
D. 當處於受壓（Stress）狀況時，需補充額外之腎上腺皮質素（Cortisol）

正確答案：D. 當處於受壓（Stress）狀況時，需補充額外之腎上腺皮質素（Cortisol）